Clinical trial inclusion criterion:
patients undergoing invasive procedures via the radial or femoral arteries

Annotated entities:
- Procedure: "invasive procedures"
- Temporal: "undergoing"
- Qualifier: "radial arteries"
- Qualifier: "femoral arteries"